Clinical trial exclusion criterion:
Positive HIV in the screening examination of history of any immunosuppressant disease;

Annotated entities:
- Measurement: "HIV"
- Value: "Positive"
- Temporal: "in the screening examination"
- Reference_point: "screening examination"
- Condition: "immunosuppressant disease"
- Undefined_semantics: "immunosuppressant disease"